Clinical trial exclusion criterion:
Inability to use verbal or pictorial pain scoring scales

Annotated entities:
- Procedure: "pictorial pain scoring scales"
- Procedure: "verbal pain scoring scales"
- Condition: "Inability"